Clinical trial exclusion criterion:
Anticipated receipt of any vaccine other than DTaP, IPV, HBV, PCV13, or Hib during the first 60 hours after randomization

Annotated entities:
- Drug: "DTaP"
- Drug: "IPV"
- Drug: "HBV"
- Drug: "PCV13"
- Drug: "Hib"
- Mood: "Anticipated receipt"
- Temporal: "during the first 60 hours after randomization"
- Reference_point: "randomization"